Hospital acquired infection

The above is a clinical trial exclusion criterion. Annotated with entity spans:
[Condition: Hospital acquired infection]